Planned fast for cultural/ religious reasons e.g. Ramadan

The above is a clinical trial exclusion criterion. Annotated with entity spans:
[Non-query-able: Planned fast for cultural/ religious reasons e.g. Ramadan]